飲用水以氯消毒，無法有效去除下列何種水媒介傳染病原？
A. 霍亂弧菌
B. 沙門桿菌
C. 梨形鞭毛蟲
D. A 型肝炎病毒

正確答案：C. 梨形鞭毛蟲